一位 30 歲的醫院工作人員，因意識不清，行為異常送醫，經檢查血糖值為 42 mg/dL，無糖尿病史，惟其弟為第一型糖尿病患，但病人數度於早班後不久發生類似狀況。抽血檢驗發現病人血中胰島素濃度偏高，而 C-肽（c-peptide）濃度偏低，其診斷最可能為：
A. 反應性低血糖（reactive hypoglycemia）
B. 早期糖尿病
C. 人為低血糖（factitious hypoglycemia）
D. 胰島素瘤（insulinoma）

正確答案：C. 人為低血糖（factitious hypoglycemia）